Clinical trial exclusion criterion:
Known or suspected hypersensitivity to trial products or related products

Annotated entities:
- Condition: "hypersensitivity"
- Drug: "trial products"
- Drug: "related products"
- Mood: "suspected"
- Mood: "Known"